Patients with severe anemia (hemoglobin <6g / dl), leukopenia (WBC <2500 / mm3) and / or thrombocytopenia (platelets <80,000 / mm3).

The above is a clinical trial exclusion criterion. Annotated with entity spans:
Patients with [Qualifier: severe] [Condition: anemia] ([Measurement: hemoglobin] [Value: <6g / dl]), [Condition: leukopenia] ([Measurement: WBC] [Value: <2500 / mm3]) and / or [Condition: thrombocytopenia] ([Measurement: platelets] [Value: <80,000 / mm3]).